no informed consent

The above is a clinical trial exclusion criterion. Annotated with entity spans:
[Non-query-able: no informed consent]